Patient has intraocular pressure (IOP) ≤ 20 mmHg.

The above is a clinical trial inclusion criterion. Annotated with entity spans:
Patient has [Measurement: intraocular pressure (IOP)] [Value: ≤ 20 mmHg].